尋常性白斑（vitiligo vulgaris）色素脫失之主要病理變化，為下列何種細胞遭受破壞？
A. 黑色素細胞（melanocyte）
B. 表皮基底細胞（basal cell）
C. 蘭格罕氏細胞（Langerhans' cell）
D. 表皮顆粒細胞（granular cell）

正確答案：A. 黑色素細胞（melanocyte）